Los anticuerpos humanizados:
1. Tienen muy baja afinidad.
2. Contienen CDRs de un anticuerpo monoclonal de ratón.
3. Tienen dominios VH y VL totalmente murinos.
4. Tienen dominios VH y VL totalmente humanos.
5. Tienen cadenas ligeras humanas.

Respuesta correcta: 2. Contienen CDRs de un anticuerpo monoclonal de ratón.